Clinical trial exclusion criterion:
Hepatitis B, hepatitis C (excluding healthy carriers) or HIV positive

Entity relations:
- Has_negation("healthy carriers", "excluding")
- AND("hepatitis C", "healthy carriers")
- OR("Hepatitis B", "hepatitis C", "HIV positive")